15歲男生，半夜睡覺突然左側睪丸劇痛，痛到臉色蒼白、冒冷汗，立即送到醫院急診。在缺乏超音波等影像 檢查之下，下列何種檢查或治療較符合一般醫療現行常規？
A. 抗生素治療
B. 睪丸切片
C. 睪丸探查手術
D. 睪丸切除手術

正確答案：C. 睪丸探查手術